3. History or diagnosis of any significant medical conditions: Including but not limited to gastrointestinal, hepatic, renal, respiratory, cardiovascular, metabolic, immunologic, hematological, psychiatric, neurological, oncological or hormonal disorders

The above is a clinical trial exclusion criterion. Annotated with entity spans:
[Parsing_Error: 3.] History or diagnosis of any [Qualifier: significant] [Condition: medical conditions]: Including but not limited to [Condition: gastrointestinal], [Condition: hepatic], [Condition: renal], [Condition: respiratory], [Condition: cardiovascular], [Condition: metabolic], [Condition: immunologic], [Condition: hematological], [Condition: psychiatric], [Condition: neurological], [Condition: oncological] or [Condition: hormonal disorders]